Unable to weight

The above is a clinical trial exclusion criterion. Annotated with entity spans:
[Condition: Unable] to [Procedure: weight]